between 18-80 years old

The above is a clinical trial inclusion criterion. Annotated with entity spans:
[Value: between 18-80 years] [Person: old]